Clinical trial exclusion criterion:
Administration of the licensed MF59-containing vaccines, e.g. Fluad™ or Addigrip™ or virosome-based influenza vaccines such as Inflexal V™, InfectoVac Flu™ or Invivac™ during the 2006-2007 influenza season.

Entity relations:
- Subsumes("virosome-based influenza vaccines", "Inflexal V")
- Subsumes("MF59-containing vaccines", "Fluad")
- Has_temporal("MF59-containing vaccines", "during the 2006-2007 influenza season")
- OR("Inflexal V", "Invivac", "InfectoVac Flu")
- OR("Fluad", "Addigrip")
- OR("MF59-containing vaccines", "virosome-based influenza vaccines")